Seborrheic eczema, Seborrheic conjunctivitis

The above is a clinical trial exclusion criterion. Annotated with entity spans:
[Condition: Seborrheic eczema], [Condition: Seborrheic conjunctivitis]